一位 85 歲的老先生最近一星期有新發作的右側偏頭痛，而且一天比一天嚴重，媳婦說老先生這兩天有嗜睡的傾向，檢查時發現左臂力道稍弱，則最可能的診斷是：
A. 偏頭痛
B. 右側鼻竇炎
C. 硬腦膜下出血
D. 老年憂鬱症

正確答案：C. 硬腦膜下出血